Clinical trial exclusion criterion:
Suicidal ideation with intent to act or with specific plan and intent in the past 6 months (Type 4 - 5 ideation on the Columbia Suicide Severity Rating Scale) or a concerning history of prior suicidal behavior.

Annotated entities:
- Condition: "Suicidal ideation"
- Temporal: "past 6 months"
- Measurement: "Columbia Suicide Severity Rating Scale"
- Value: "Type 5 ideation"
- Value: "Type 4 ideation"
- Condition: "suicidal behavior."